Clinical trial inclusion criterion:
BCLC stage of 0-B;

Annotated entities:
- Measurement: "BCLC stage"
- Value: "0-B"